Clinical trial exclusion criterion:
Progressive neurological disease

Entity relations:
- Has_qualifier("neurological disease", "Progressive")